下列有關兒童腎病症候群之病生理的敘述，何者錯誤？
A. 病童的血管內容積（intravascular volume）會降低
B. 病童血液中的血色素（hemoglobin）值會上升
C. 病童的抗利尿激素（antidiuretic hormone）的分泌會增加
D. 病童會因腎小管的鈉離子再吸收降低而出現低血鈉症（Hyponatremia）

正確答案：D. 病童會因腎小管的鈉離子再吸收降低而出現低血鈉症（Hyponatremia）